Clinical trial inclusion criterion:
5. Subjects must report menstrual periods occurring within 21-60 days from the start of one period to the start of the next menstrual period

Annotated entities:
- Condition: "menstrual periods"
- Temporal: "within 21-60 days from the start of one period"
- Reference_point: "the start of one period"